Previously received an allogeneic transplant.

The above is a clinical trial exclusion criterion. Annotated with entity spans:
Previously received an [Procedure: allogeneic transplant].